Clinical trial exclusion criterion:
Diagnosis of cancer.

Annotated entities:
- Condition: "cancer"